Receive prior treatment including first-line platinum-based chemotherapy, standard second-line chemotherapy and 1 EGF/EGFR inhibitor

The above is a clinical trial inclusion criterion. Annotated with entity spans:
Receive prior [Procedure: treatment] including first-line [Procedure: platinum-based chemotherapy], [Qualifier: standard] [Procedure: second-line chemotherapy] and [Drug: 1 EGF/EGFR inhibitor]